Clinical trial exclusion criterion:
inclusion in other randomized studies

Annotated entities:
- Competing_trial: "inclusion in other randomized studies"